膈神經（phrenic nerve）起自那個脊髓段位？
A. C3～5
B. C7～T2
C. T3～5
D. T6～10

正確答案：A. C3～5